En una distribución de frecuencias, ¿cómo denominamos al número de veces que se repite en la muestra un determinado valor de la variable o cualquier otro valor inferior?
1. Proporción.
2. Frecuencia absoluta acumulada.
3. Porcentaje acumulado.
4. Frecuencia absoluta.
5. Frecuencia relativa acumulada.

Respuesta correcta: 2. Frecuencia absoluta acumulada.